Clinical trial inclusion criterion:
Gestational age 27 0/7 to 36 6/7 weeks;

Entity relations:
- Has_value("Gestational age", "27 0/7 to 36 6/7 weeks")